下列何者為體液免疫（humoral immunity）缺乏的指標？
A. 麻疹病毒（measles virus）皮膚測試呈陰性反應
B. 胞內細菌（intracellular bacteria）的重複感染
C. 血清中抗體量較一般值低
D. 以豆球蛋白 concanavalin A（Con A）刺激無法造成淋巴細胞增生

正確答案：C. 血清中抗體量較一般值低